Maxilla and mandible

The above is a clinical trial inclusion criterion. Annotated with entity spans:
[Qualifier: Maxilla] and [Qualifier: mandible]